陰道鏡檢（colposcopy）在某些情況下會懷疑有侵襲性癌的可能，下列何者不包括在內？
A. 不正常的血管分支
B. 子宮頸外翻
C. 顏色的改變
D. 不規則表面

正確答案：B. 子宮頸外翻